Clinical trial inclusion criterion:
the subjects have completed the basic immunization of 2 needle recombinant hepatitis B vaccine, there is no inoculation history of EV71 vaccine, and no history of EV71 infection

Entity relations:
- Has_negation("history", "no")
- Has_negation("inoculation", "no")
- Has_temporal("inoculation", "history")
- AND("EV71 vaccine", "inoculation")
- Has_multiplier("needle recombinant hepatitis B vaccine", "2")
- Has_temporal("EV71 infection", "history")
- OR("needle recombinant hepatitis B vaccine", "EV71 infection", "inoculation")